25歲何小姐到院初診，身高156 cm、體重75 Kg、BMI=30.8，臉上有許多青春痘，以前曾經發生過2次長期而 量多的出血，上一次月經是3個月前，這3個月，都在每月的15日前後，有1天的微量出血，下列何者為非必要之檢查？
A. 測定血中estradiol（E2）、FSH及LH之濃度
B. 尿液懷孕試
C. 染色體檢查
D. 婦產科超音波檢查

正確答案：C. 染色體檢查